Clinical trial inclusion criterion:
4. Years, range 18-60

Annotated entities:
- Person: "Years"
- Value: "18-60"